Clinical trial exclusion criterion:
Late diabetic complications as retinopathy, renal insufficiency, neuropathy or previous pancreatitis.

Entity relations:
- Has_temporal("pancreatitis", "previous")
- Subsumes("Late diabetic complications", "retinopathy")
- OR("retinopathy", "renal insufficiency", "neuropathy")
- OR("Late diabetic complications", "pancreatitis")